Describe the role of epidermal CYLD inactivation in sebaceous and basaloid skin tumors

Epidermal CYLD inactivation sensitizes mice to the development of sebaceous and basaloid skin tumors. The deubiquitinase-encoding gene Cyld displays a dominant genetic linkage to a wide spectrum of skin-appendage tumors, which could be collectively designated as CYLD mutant-syndrome (CYLDm-syndrome).